Clinical trial inclusion criterion:
Men: (0.006012 x H3) + (14.6 x W) + 604 = TBV

Annotated entities:
- Person: "Men"
- Measurement: "TBV"
- Value: "(0.006012 x H3) + (14.6 x W) + 604 ="